Weight gain or loss > 5 kg in the last 3 months, ongoing weight-loss diet (hypocaloric diet) or use of weight loss agents.

The above is a clinical trial exclusion criterion. Annotated with entity spans:
[Measurement: Weight gain] or loss [Value: > 5 kg] [Temporal: in the last 3 months], [Temporal: ongoing] [Observation: weight-loss diet] ([Observation: hypocaloric diet]) or use of [Drug: weight loss agents].